9. Diabetes agents: glibenclamide, glyburide

The above is a clinical trial exclusion criterion. Annotated with entity spans:
[Parsing_Error: 9.] Diabetes agents: [Drug: glibenclamide], [Drug: glyburide]